某研究收集30人的收縮壓（mmHg）及年齡的隨機樣本資料，計算皮爾森氏相關係數（Pearson's correlation coefficient）得 0.7。假若同樣的資料，以血壓當依變項（Y；dependent variable），以年齡當自變項（X； independent variable），可得到直線迴歸線t = a+bX 。下列何者正確？
A. b一定大於零
B. a一定小於零
C. 血壓的變化有70%可被年齡的變異所解釋
D. 平均每增加一歲，則收縮壓就增加0.7mmHg

正確答案：A. b一定大於零